Patients from whom informed consent cannot be obtained

The above is a clinical trial exclusion criterion. Annotated with entity spans:
[Informed_consent: Patients from whom informed consent cannot be obtained]